惡性腫瘤細胞不以下列何種方式避開免疫細胞之消滅作用？
A. 腫瘤細胞能吞噬並分解 T 細胞
B. 腫瘤細胞表面缺乏 adhesion molecules 及 peptide: MHCI 等分子
C. 腫瘤細胞表面抗原作用於 T 細胞，使其變成無反應性（tolerize）
D. 腫瘤細胞產生抑制 T 細胞的物質

正確答案：A. 腫瘤細胞能吞噬並分解 T 細胞